Es un aminoácido cuya cadena lateral contiene una amina:
1. Lisina.
2. Glutamina.
3. Cisteína.
4. Serina.
5. Alanina.

Respuesta correcta: 1. Lisina.